下列有關顳骨岩部（petrous portion of temporal bone）之敘述，何者錯誤？
A. 岩大神經（Greater petrosal nerve）由膝狀神經節（geniculate ganglion）處分出
B. 岩小神經（Lesser petrosal nerve）內含之副交感神經節後纖維源自於第九顱神經
C. 岩深神經（Deep petrosal nerve）內含交感神經節後纖維
D. 岩大神經及岩深神經進入翼管形成翼管神經（nerve of pterygoid canal）

正確答案：B. 岩小神經（Lesser petrosal nerve）內含之副交感神經節後纖維源自於第九顱神經